缺乏下列何種酵素，會讓新生兒使用 Chloramphenicol 時造成"Gray baby＂？
A. UDP-glucuronyl transferase
B. Cytochrome p-450
C. Glutathione transferase
D. N-Acetyl transferase

正確答案：A. UDP-glucuronyl transferase